Clinical trial exclusion criterion:
Palpable fibroids or uterine prolapse: Grade 2 or 3.

Annotated entities:
- Condition: "Palpable fibroids"
- Condition: "uterine prolapse"
- Measurement: "Grade"
- Value: "2 or 3"